ASA (American Society of Anesthesiologists) class 1 & 2,

The above is a clinical trial inclusion criterion. Annotated with entity spans:
[Measurement: ASA] (American Society of Anesthesiologists) [Value: class 1 & 2],